Clinical trial exclusion criterion:
The patient has received prior surgery for primary tumor or lymph node ( except for biopsy )

Entity relations:
- Has_temporal("surgery", "prior")
- Has_qualifier("tumor", "primary")
- AND("surgery", "tumor")
- Has_negation("biopsy", "except for")
- Subsumes("surgery", "biopsy")
- OR("tumor", "lymph node")